Clinical trial inclusion criterion:
Completion of a 14-week open label trial of one the following SRI's: fluoxetine 80 mg/day, paroxetine 60 mg/day, fluvoxamine 300 mg/day, clomipramine 250 mg/day, sertraline 200 mg/day, citalopram 60 mg/day, escitalopram 30 mg/day and demonstrating a non or partial responses to SRI treatment (CGI-I of 3 or 4, Y-BOCS reduction of < 35%)

Entity relations:
- Has_value("CGI-I", "3")
- Has_value("Y-BOCS", "reduction of < 35%")
- Has_multiplier("fluoxetine", "80 mg/day")
- Has_multiplier("paroxetine", "60 mg/day")
- Has_multiplier("fluvoxamine", "300 mg/day")
- Has_multiplier("clomipramine", "250 mg/day")
- Has_multiplier("sertraline", "200 mg/day")
- Has_multiplier("citalopram", "60 mg/day")
- Has_multiplier("escitalopram", "30 mg/day")
- Has_multiplier("fluoxetine", "one the following")
- Has_multiplier("fluoxetine", "14-week")
- AND("responses to", "SRI treatment")
- Subsumes("responses to", "CGI-I")
- OR("3", "4")
- OR("CGI-I", "Y-BOCS")
- OR("fluoxetine", "paroxetine", "fluvoxamine", "clomipramine", "sertraline", "citalopram", "escitalopram")